Clinical trial exclusion criterion:
impaired decision making

Annotated entities:
- Condition: "impaired decision making"